Clinical trial exclusion criterion:
CYP2C9 substrates such as tolbutamide (because of expected inhibition of the metabolism of CYP2C9 substrates by venetoclax. It is recommended to exclude CYP2C9 substrates with a narrow therapeutic index such as phenytoin.

Entity relations:
- Subsumes("CYP2C9 substrates", "tolbutamide")
- Has_qualifier("CYP2C9 substrates", "narrow therapeutic index")
- Subsumes("CYP2C9 substrates", "phenytoin")